Clinical trial inclusion criterion:
Able to perform some small wrist flexion and extension

Annotated entities:
- Mood: "Able to"
- Procedure: "small wrist flexion and extension"